一位 23 歲男性病人，身高 183 公分，體重 70 公斤，高中時曾患腮腺炎（mumps），婚前至內科門診就醫。病人描述未有性衝動，學業成績中等，未入伍服兵役。理學檢查，外觀白晳，鬍鬚不明顯。陰莖長 5 公分，且陰毛稀疏。內分泌檢查，Testosterone: 1.0 ng/mL（正常值：2.41-8.27 ng/mL）； LH: 0.5 mIU/mL（正常值：1.0-12.0 mIU/mL）；FSH: 0.2 mIU/mL（正常值：2.0-12.0 mIU/mL）。 下列何者是最可能之診斷？
A. 原發性功能低下（Primary hypogonadism）
B. 次發性功能低下（Secondary hypogonadism）
C. 腮腺炎後遺症
D. 克萊恩費特氏症（Klinefelter's syndrome）

正確答案：B. 次發性功能低下（Secondary hypogonadism）